Calculated creatinine clearance < 30 mL/min by Cockcroft-Gault formula

The above is a clinical trial exclusion criterion. Annotated with entity spans:
[Measurement: Calculated creatinine clearance] [Value: < 30 mL/min] by [Measurement: Cockcroft-Gault formula]